¿Cuál de los siguientes virus codifica una transcriptasa inversa?
1. Parvovirus.
2. Reovirus.
3. Hepadnavirus.
4. Flavivirus.

Respuesta correcta: 3. Hepadnavirus.